Positive Antigen HBs in the screening evaluation;

The above is a clinical trial exclusion criterion. Annotated with entity spans:
[Value: Positive] [Measurement: Antigen HBs] [Temporal: in the screening evaluation];